人類腺病毒（adenovirus）與下列何種病毒使用相同的細胞受器（receptor）？
A. B型克沙奇病毒（Coxsackie B virus）
B. 諾羅病毒（Norovirus）
C. 巨細胞病毒（Cytomegalovirus）
D. 流感病毒（Influenza virus）

正確答案：A. B型克沙奇病毒（Coxsackie B virus）